Patients who do not meet the inclusion criteria and those who have a history of allergic reactions to human albumin, as well as those who have received iodinated contrast during the 7 days prior to surgery and pregnant women, will be excluded from the study.

The above is a clinical trial exclusion criterion. Annotated with entity spans:
Patients who do [Negation: not] [Observation: meet the inclusion criteria] and those who have a [Temporal: history] of [Condition: allergic] reactions to [Drug: human albumin], as well as those who have received [Drug: iodinated contrast] [Temporal: during the 7 days prior to surgery] and [Condition: pregnant] [Person: women], will be excluded from the study.